En la insuficiencia cardiaca derecha se observan las siguientes manifestaciones clínicas, EXCEPTO una de ellas, señálela:
1. Ingurgitación yugular.
2. Disnea paroxística nocturna.
3. Edema en miembros inferiores.
4. Hepatomegalia dolorosa.

Respuesta correcta: 2. Disnea paroxística nocturna.